有關抗組織胺與抗暈車藥的敘述，下列何者正確？
A. 第二代抗組織胺 Loratadine 可當作暈車藥
B. H2 blocker也可以有抗暈車功能
C. Meclizine 具有 anti-adrenergic effect
D. Diphenhydramine 是一種抗組織胺，但是可作為抗暈車藥

正確答案：D. Diphenhydramine 是一種抗組織胺，但是可作為抗暈車藥